Clinical trial exclusion criterion:
Household members of children in Group A

Annotated entities:
- Person: "Household members"
- Person: "children"
- Person: "Group A"